3. During the course of the study, from study screen until study exit - including the washout period, women of childbearing potential must use a spermicide containing barrier method of contraception in addition to their current contraceptive device. This advice should be documented in the informed consent form.

The above is a clinical trial inclusion criterion. Annotated with entity spans:
3. [Temporal: During the course of the study], from study screen until study exit - including the washout period, [Person: women] of [Condition: childbearing potential] must use a [Procedure: spermicide containing barrier method of contraception] [Multiplier: in addition to] their [Temporal: current] [Device: contraceptive device]. This advice should be documented in the informed consent form.